Clinical trial exclusion criterion:
Treatment with rifaximin or neomycin in the previous 7 days.

Annotated entities:
- Drug: "rifaximin"
- Drug: "neomycin"
- Temporal: "in the previous 7 days"